5. Are not scheduled to undergo conventional ultrasound

The above is a clinical trial exclusion criterion. Annotated with entity spans:
5. Are [Negation: not] [Mood: scheduled] to undergo [Procedure: conventional ultrasound]